Which chromosome contains the TLR7 locus in the human genome?

The X chromosome. TLR7 is encoded by a gene on X chromosome Xp22.